Clinical trial inclusion criterion:
Panel Reactive Antibody (PRA) < 30%.

Annotated entities:
- Measurement: "Panel Reactive Antibody (PRA)"
- Value: "< 30%"